癌症細胞常有過度分裂繁殖之現象。治療癌症之藥物也常針對此特性。下列何種藥物可以抑制 thymidylate synthase？
A. methotrexate
B. 5-FU（5-fluorouracil）
C. cyclophosphamide
D. vinca alkaloids（vincristine）

正確答案：B. 5-FU（5-fluorouracil）